History of three or more consecutively failed In Vitro Fertilization (IVF) cycles after embryo transfer

The above is a clinical trial exclusion criterion. Annotated with entity spans:
History of [Multiplier: three or more] [Qualifier: consecutively failed] [Procedure: In Vitro Fertilization] ([Procedure: IVF]) cycles [Temporal: after embryo transfer]